Clinical trial exclusion criterion:
Multiple significant trauma (i.e. significant intracranial and extracranial injuries including limb fractures) that would limit observation of recovery from spinal cord injury

Annotated entities:
- Condition: "trauma"
- Qualifier: "Multiple"
- Qualifier: "significant"
- Condition: "extracranial injuries"
- Condition: "intracranial injuries"
- Condition: "limb fractures"